Clinical trial exclusion criterion:
Subject has symptomatic carotid stenosis.

Entity relations:
- Has_qualifier("carotid stenosis", "symptomatic")